Clinical trial exclusion criterion:
Systemic therapy or radiotherapy within 4 weeks prior to Day 1

Annotated entities:
- Procedure: "Systemic therapy"
- Procedure: "radiotherapy"
- Temporal: "within 4 weeks prior to Day 1"
- Reference_point: "Day 1"